Clinical trial exclusion criterion:
Oxygen therapy: Subjects receiving treatment with long-term oxygen therapy (LTOT) or nocturnal oxygen therapy required for greater than 12 hours a day. Oxygen prn use (i.e. <=12 hours per day) is not exclusionary.

Entity relations:
- Has_multiplier("long-term oxygen therapy (LTOT)", "greater than 12 hours a day")
- OR("long-term oxygen therapy (LTOT)", "nocturnal oxygen therapy")